known platelet count < 100.000/µL at the time of screening

The above is a clinical trial inclusion criterion. Annotated with entity spans:
known [Measurement: platelet count] [Value: < 100.000/µL] [Temporal: at the time of screening]